Subjects with a measured post-albuterol/salbutamol FEV1 >=50 and <=70% of predicted normal values calculated using NHANES III reference equations [Hankinson, 1999; Hankinson, 2010] at Screening (Visit 1).

The above is a clinical trial inclusion criterion. Annotated with entity spans:
Subjects with a measured [Qualifier: post-albuterol/salbutamol] [Measurement: FEV1] [Value: >=50 and <=70% of predicted normal values] calculated [Qualifier: using NHANES III reference equations] [Hankinson, 1999; Hankinson, 2010] [Temporal: at Screening] (Visit 1).